Clinical trial inclusion criterion:
Ability to understand and the willingness to sign a written informed consent.

Annotated entities:
- Observation: "Ability to understand a written informed consent"
- Observation: "willingness to sign a written informed consent"